58 歲女性因慢性腎衰竭就醫，過去病史記載病人因長期頭痛而經常服用混合鎮痛劑（含 aspirin、 phenacetin 或 acetaminophen 等）。此病人最可能的腎病變為：
A. Diffuse cortical necrosis
B. Papillary necrosis
C. Acute tubular necrosis
D. Focal cortical infarction

正確答案：B. Papillary necrosis